Clinical trial inclusion criterion:
If HBV DNA is negative, the subject may be included but must undergo HBV DNA PCR testing monthly x 3 months beginning from the start of treatment

Entity relations:
- Has_value("HBV DNA", "negative")